1. Atrial fibrillation;

The above is a clinical trial exclusion criterion. Annotated with entity spans:
1. [Condition: Atrial fibrillation];